Patients receiving drugs affecting immune system like immunosuppressive drugs.

The above is a clinical trial exclusion criterion. Annotated with entity spans:
Patients receiving [Drug: drugs affecting immune system] like [Drug: immunosuppressive drugs].